Clinical trial exclusion criterion:
Cardiogenic shock;

Annotated entities:
- Condition: "Cardiogenic shock"